Treated with Ursodeoxycholic Acid in West China Hospital for at least 6 month and suboptimal response to Ursodeoxycholic Acid

The above is a clinical trial inclusion criterion. Annotated with entity spans:
Treated with [Drug: Ursodeoxycholic Acid] in [Visit: West China Hospital] [Temporal: for at least 6 month] and [Condition: suboptimal response] to [Drug: Ursodeoxycholic Acid]